一位27歲男性因為牙齦出血不止來到醫院，血液檢查發現血紅素為8.2 gm/dL，白血球1250/µL，其中promyelocyte 18%， segmented neutrophil 2%，monocytes 8%，lymphocytes 72%，血小板21000/µL。骨髓穿刺檢查證明為acute promyelocytic leukemia。下列各選項，何者是治療此病人所必須的？ ①platelet transfusion ②chemotherapy ③all-trans retinoic acid
A. ①②
B. ②③
C. ①③
D. ①②③

正確答案：D. ①②③